Clinical trial inclusion criterion:
Meets 1 of the following: At least 12 months of spontaneous amenorrhea; At least 6 months of spontaneous amenorrhea with serum follicle-stimulating hormone (FSH) levels > 40 mIU/mL; At least 6 weeks postsurgical bilateral oophorectomy (with or without hysterectomy). Hysterectomized without bilateral oophorectomy and with serum FSH levels >40 mIU/mL.

Entity relations:
- Has_temporal("spontaneous amenorrhea", "At least 12 months")
- Has_temporal("spontaneous amenorrhea", "At least 6 months")
- Has_value("serum follicle-stimulating hormone (FSH) levels", "> 40 mIU/mL")
- Subsumes("bilateral oophorectomy", "bilateral oophorectomy with hysterectomy")
- Has_temporal("bilateral oophorectomy", "At least 6 weeks postsurgical")
- Has_negation("bilateral oophorectomy", "without")
- Has_value("serum FSH levels", ">40 mIU/mL")
- Has_temporal("bilateral oophorectomy with hysterectomy", "At least 6 weeks postsurgical")
- OR("bilateral oophorectomy with hysterectomy", "bilateral oophorectomy without hysterectomy")
- OR("bilateral oophorectomy", "Hysterectomized")
- OR("bilateral oophorectomy with hysterectomy", "Hysterectomized")